Clinical trial exclusion criterion:
Acute liver injury (liver aminotransferase concentrations >5 times the upper limit of normal)

Entity relations:
- Has_value("liver aminotransferase concentrations", ">5 times the upper limit of normal")
- Subsumes("Acute liver injury", "liver aminotransferase concentrations")